Concomitant chronic inflammatory diseases on any ocular structure

The above is a clinical trial exclusion criterion. Annotated with entity spans:
[Temporal: Concomitant] [Condition: chronic inflammatory diseases] on any [Qualifier: ocular structure]